Clinical trial inclusion criterion:
Type 2 diabetic inpatient

Annotated entities:
- Condition: "Type 2 diabetic"
- Visit: "inpatient"